Las siguientes entidades pueden acompañarse de inflamación ocular (uveítis) excepto una. Indique cuál:
1. Sarcoidosis.
2. Artritis Idiopática Juvenil.
3. Enfermedad de Behçet.
4. Enfermedad de Marfan.
5. Esclerosis múltiple.

Respuesta correcta: 4. Enfermedad de Marfan.